Clinical trial inclusion criterion:
presents with signs and symptoms of a SSTI

Annotated entities:
- Condition: "signs"
- Condition: "symptoms"
- Condition: "SSTI"